一位 40 歲的女性，近半年多呈現持續容易過度擔心，這樣的擔心令她難以控制，而且擔心時會出現不安、全身緊繃、容易疲倦與睡眠障礙，以上症狀造成她明顯的苦惱。下列關於此病人的描述，何者有誤？
A. 這類病人常同時罹患社交恐懼症、恐慌症或憂鬱症
B. 鑑別診斷上，醫療人員須考慮咖啡中毒、興奮劑濫用、酒精戒斷與精神作用藥物戒斷
C. 目前藥物治療以苯二氮平（benzodiazepines）為主，選擇性血清素再吸收抑制劑（SSRI）對此疾病之效果不佳
D. 主要的心理治療為認知行為治療、支持性心理治療、病識感導向心理治療

正確答案：C. 目前藥物治療以苯二氮平（benzodiazepines）為主，選擇性血清素再吸收抑制劑（SSRI）對此疾病之效果不佳